Clinical trial inclusion criterion:
Licensed nursing home in Orange County or Southern Los Angeles County serving adults

Annotated entities:
- Visit: "Licensed nursing home"
- Visit: "Orange County"
- Visit: "Southern Los Angeles County"
- Qualifier: "serving adults"